Clinical trial exclusion criterion:
Pregnant or nursing women.

Annotated entities:
- Condition: "Pregnant"
- Condition: "nursing"
- Person: "women"